Clinical trial exclusion criterion:
Serum creatinine greater than 3 times ULN.

Annotated entities:
- Measurement: "Serum creatinine"
- Value: "greater than 3 times ULN"